Clinical trial inclusion criterion:
Visual impairment predominantly due to abnormal new vessel ingrowth and/or macular edema. The presence of fluid (intraretinal, subretinal or sub-RPE) detected clinically or on the ocular coherence tomography.

Annotated entities:
- Condition: "Visual impairment"
- Condition: "abnormal new vessel ingrowth"
- Condition: "macular edema"
- Qualifier: "intraretinal"
- Qualifier: "subretinal"
- Qualifier: "sub-RPE"
- Procedure: "ocular coherence tomography"
- Condition: "fluid"